Clinical trial exclusion criterion:
Anti-depressants with anti-cholinergic properties

Entity relations:
- Has_qualifier("Anti-depressants", "anti-cholinergic properties")
- multi("anti-cholinergic properties", "anti-cholinergic")